Clinical trial inclusion criterion:
diagnosis of spinal deformity

Annotated entities:
- Condition: "spinal deformity"